Clinical trial exclusion criterion:
Atypical hemolytic uremic syndrome (aHUS) / thrombotic thrombocytopenic purpura syndrome.

Annotated entities:
- Condition: "Atypical hemolytic uremic syndrome (aHUS)"
- Condition: "thrombotic thrombocytopenic purpura syndrome"